What is the role of Acyl-Homoserine Lactone  in bacteria?

tructural analogues of acyl homoserine lactones with Quorum Sensing antagonist activity.